Clinical trial inclusion criterion:
estimated glomerular filtration rate (eGFR) > 60 ml/min

Annotated entities:
- Measurement: "estimated glomerular filtration rate (eGFR)"
- Value: "> 60 ml/min"